關於生理心理社會模式（biopsychosocial models）的敘述，下列何者正確？
A. 生理層面包含影響生理功能之環境因素
B. 心理層面包含基因及疾病史
C. 社會層面包含情感及意志
D. 社會層面包含人格特質及應對方式（coping style）

正確答案：A. 生理層面包含影響生理功能之環境因素